En relación a la rubeola y al embarazo, señale la respuesta INCORRECTA:
1. El riesgo de anomalías congénitas es muy elevado cuando la infección ocurre en las primeras semanas de la gestación.
2. Las lesiones fetales más frecuentes que se producen constituyen la llamada “triada de Gregg”.
3. El diagnóstico de la inmunidad materna se realiza mediante la determinación serológica de anticuerpos IgG.
4. Debido a su gran potencial teratógeno, a las mujeres no inmunizadas se les administrará la vacuna durante la gestación.

Respuesta correcta: 4. Debido a su gran potencial teratógeno, a las mujeres no inmunizadas se les administrará la vacuna durante la gestación.